Clinical trial exclusion criterion:
Hemoglobin < 11.5 g/dL for females and < 12.5 g/dL for men at screening.

Annotated entities:
- Measurement: "Hemoglobin"
- Value: "< 11.5 g/dL"
- Person: "females"
- Value: "< 12.5 g/dL"
- Person: "men"
- Temporal: "at screening"